Clinical trial exclusion criterion:
no co-operation or inadequate finnish language skills

Entity relations:
- Has_negation("co-operation", "no")
- OR("co-operation", "inadequate finnish language skills")